重症肌無力（myasthenia gravis）與下列那一個組織或器官的增生有關？
A. 胸腺（thymus）
B. 甲狀腺（thyroid gland）
C. 腎上腺皮質（adrenal gland）
D. 骨髓內之漿細胞（plasma cell）

正確答案：A. 胸腺（thymus）